Clinical trial exclusion criterion:
renal insufficiency (calculated glomerular filtration rate under 60 ml/min/1.73 m2 according to Cockcroft-Gault scale )

Annotated entities:
- Condition: "renal insufficiency"
- Measurement: "calculated glomerular filtration rate"
- Value: "under 60 ml/min/1.73 m2"
- Qualifier: "Cockcroft-Gault scale"